Unstable medical disease of comorbid psychiatric disease

The above is a clinical trial exclusion criterion. Annotated with entity spans:
[Condition: Unstable medical disease] of [Condition: comorbid psychiatric disease]